錢女士 65 歲，因胸痛至醫院住院檢查與治療，三天前於病房跌倒致左髖部受傷，因左髖部疼痛而無法行動，昨天左下肢出現疼痛及腫大，Homan's sign（+）。下列何項治療適當？①同時合併靜脈注射肝素（unfractionated heparin）及口服 warfarin ②靜脈注射 80 U/kg 肝素，然後 15-18U/kg/hour 持續靜脈滴注 ③低分子量肝素（low-molecular weight heparin）須於手術前 12 至 24 小時停用 ④靜脈注射 5000U 肝素一次即可
A. ①②③
B. 僅①③
C. ②④
D. 僅④

正確答案：A. ①②③